Clinical trial exclusion criterion:
Respiratory pathologies, cardiovascular, renal, diabetes

Entity relations:
- OR("Respiratory pathologies", "cardiovascular", "renal", "diabetes")